Clinical trial exclusion criterion:
Patients participating in previous, concurrent or not, trials (ongoing or completed within three months);

Annotated entities:
- Temporal: "previous"
- Observation: "trials participating in"
- Qualifier: "ongoing"
- Qualifier: "completed"
- Temporal: "within three months"